Clinical trial exclusion criterion:
Known active brain metastases

Entity relations:
- Has_qualifier("brain metastases", "active")
- multi("active", "active")